Clinical trial exclusion criterion:
Persons with a history of severe allergic reaction after previous vaccinations or hypersensitivity to any seasonal influenza vaccine component

Entity relations:
- Has_qualifier("allergic reaction", "severe")
- Has_temporal("allergic reaction", "history")
- Has_index("after previous vaccinations", "previous vaccinations")
- Has_temporal("allergic reaction", "after previous vaccinations")
- OR("allergic reaction", "hypersensitivity to any seasonal influenza vaccine component")